Patients with any other severe concurrent disease, which in the judgment of the investigator, would make the patient inappropriate for entry into this study.

The above is a clinical trial exclusion criterion. Annotated with entity spans:
Patients with any other [Qualifier: severe] [Condition: concurrent disease], [Non-query-able: which in the judgment of the investigator,] would make the patient [Mood: inappropriate for] [Observation: entry into this study].